Clinical trial exclusion criterion:
Subjects with a history of more than three adequate trials with an SSRI.

Annotated entities:
- Competing_trial: "Subjects with a history of more than three adequate trials with an SSRI"